診斷4歲孩童氣喘，下列何者為最主要的診斷方式？
A. 病史詢問
B. 抽血檢查Total IgE
C. 肺功能測試
D. 皮膚過敏測試

正確答案：A. 病史詢問